Patients who meet 1987 ACR criteria for SLE with 1996 modifications

The above is a clinical trial inclusion criterion. Annotated with entity spans:
Patients who meet [Measurement: 1987 ACR criteria] for [Condition: SLE] with 1996 modifications